Clinical trial exclusion criterion:
Patients with communication difficulties.

Annotated entities:
- Condition: "communication difficulties"